Clinical trial inclusion criterion:
signed informed consent.

Annotated entities:
- Non-query-able: "signed informed consent"